Clinical trial inclusion criterion:
Be scheduled for trans-jugular liver biopsy the day of the ultrasound procedure.

Annotated entities:
- Procedure: "trans-jugular liver biopsy"
- Temporal: "the day of the ultrasound procedure"
- Reference_point: "ultrasound procedure"
- Procedure: "ultrasound procedure"